Clinical trial exclusion criterion:
History of being treated for tuberculosis in the prior 2 years unless there is DST, including PCR testing, showing sensitivity to rifamycin.

Entity relations:
- AND("treated", "tuberculosis")
- AND("sensitivity", "rifamycin")
- AND("PCR testing", "sensitivity")
- Has_temporal("treated", "in the prior 2 years")
- Subsumes("DST", "PCR testing")
- OR("treated", "DST")